¿Qué caracteriza a las técnicas proyectivas?
1. La escasa ambigüedad del estímulo.
2. El formato de respuesta cerrada.
3. El tratarse de técnicas objetivas de evaluación.
4. Que el análisis de sus respuestas es fundamentalmente cuantitativo.
5. Que son técnicas “enmascaradas” de evaluación.

Respuesta correcta: 5. Que son técnicas “enmascaradas” de evaluación.